鼻竇炎感染引起海綿靜脈竇栓塞，最常經由下列何者而來？
A. 前顏面靜脈（anterior facial vein）
B. 後顏面靜脈（posterior facial vein）
C. 角靜脈（angular vein）
D. 淺顳靜脈（superficial temporal vein）

正確答案：C. 角靜脈（angular vein）